Which histone mark is recognized by HP1?

Methylation of histone H3 lysine 9 creates a binding site for HP1 proteins. We show that methylated lysine 9 of histone H3 (Me9H3) is a marker of heterochromatin in divergent animal species.